Patients with non-psychotic comorbid conditions may be included.

The above is a clinical trial inclusion criterion. Annotated with entity spans:
Patients with [Condition: non-psychotic] comorbid conditions may be included.